Clinical trial exclusion criterion:
A clinical diagnosis of influenza within the previous 12 months

Annotated entities:
- Condition: "influenza"
- Temporal: "within the previous 12 months"